Clinical trial exclusion criterion:
Neurological brain disease and/or history of electroconvulsive therapy;

Entity relations:
- Has_qualifier("brain disease", "Neurological")
- OR("brain disease", "electroconvulsive therapy")